Epilepsy.

The above is a clinical trial exclusion criterion. Annotated with entity spans:
[Condition: Epilepsy].